有關卵巢生殖細胞索或間質細胞瘤（ovarian sex cord-stromal tumors） 的病理或臨床特徵，下列何者錯誤？
A. Call-Exner bodies是卵巢支持間質細胞瘤（Sertoli-Leydig cell tumor）的特徵
B. 咖啡豆溝痕的核仁（coffee-bean grooved nuclei） 是卵巢顆粒細胞瘤（granulosa cell tumor）的特徵
C. 成人型卵巢顆粒細胞瘤（adult-type granulosa cell tumor）可能伴隨有子宮內膜增生或子宮內膜癌的發生
D. 與男性化有關的腫瘤是卵巢支持間質細胞瘤（Sertoli-Leydig cell tumor）

正確答案：A. Call-Exner bodies是卵巢支持間質細胞瘤（Sertoli-Leydig cell tumor）的特徵